Clinical trial exclusion criterion:
Receiving warfarin or other oral anticoagulant

Annotated entities:
- Drug: "warfarin"
- Condition: "oral anticoagulant"
- Qualifier: "other"